下列有關頸椎脊髓病變（cervical myelopathy）臨床症狀之敘述，何者最正確？
A. 膝肌腱反射（knee jerk）消失
B. 下肢痙攣性無力（spastic weakness of lower limbs）
C. 僅有單側神經性疼痛（unilateral neurogenic pain）出現
D. 本體感受與震動感覺（proprioceptive and vibration）改變為最早的臨床症狀

正確答案：B. 下肢痙攣性無力（spastic weakness of lower limbs）